Other clinically relevant heart disease

The above is a clinical trial exclusion criterion. Annotated with entity spans:
Other clinically relevant [Condition: heart disease]